下列關於大腸直腸癌治療之敘述，何者正確？
A. 第二期或第三期的直腸癌，可以在術前施行CCRT（concurrent chemoradiotherapy）減少復發機會並促進治癒
B. 肛門癌的危險因子與大腸直腸癌相類似
C. K-ras基因突變者，對於標靶藥物cetuximab會有比較好的反應
D. 儘管手術完整切除腫瘤，縫合處復發（anastomotic recurrences）為大腸直腸癌術後最常見的復發部位，因此大腸鏡是最重要的追蹤檢查

正確答案：A. 第二期或第三期的直腸癌，可以在術前施行CCRT（concurrent chemoradiotherapy）減少復發機會並促進治癒